下列有關腹瀉（diarrhea）的敘述，何者錯誤？
A. 滲透性（osmotic）腹瀉，禁食後症狀會改善
B. 分泌性（secretory）腹瀉，禁食後症狀不會改善
C. 脂肪痢性（steatorrhea）腹瀉，糞便脂肪超過正常量 1 天 7 公克
D. 超過 4 個月的腹瀉，稱為慢性腹瀉

正確答案：D. 超過 4 個月的腹瀉，稱為慢性腹瀉